Clinical trial exclusion criterion:
Any contradiction to Bisoprolol according to label, including:

Annotated entities:
- Drug: "Bisoprolol"
- Condition: "contradiction"